Clinical trial exclusion criterion:
Renal disorder or insufficiency

Entity relations:
- OR("Renal disorder", "Renal insufficiency")